Clinical trial exclusion criterion:
Karnofsky Performance Status (KPS) < 60.

Entity relations:
- Subsumes("Karnofsky Performance Status", "KPS")
- Has_value("Karnofsky Performance Status", "< 60")